Clinical trial inclusion criterion:
Assumes primary responsibility for taking medication

Annotated entities:
- Non-query-able: "Assumes primary responsibility for taking medication"